2. Currently breast-feeding

The above is a clinical trial exclusion criterion. Annotated with entity spans:
2. [Temporal: Currently] [Condition: breast-feeding]